Nursing homes will not be eligible to participate if they meet the following criteria:

The above is a clinical trial exclusion criterion. Annotated with entity spans:
[Visit: Nursing homes] will not be eligible to participate [Non-representable: if they meet the following criteria:]